懷孕期間不增加的凝血因子是：
A. factor VII
B. factor VIII
C. factor IX
D. factor XI

正確答案：D. factor XI